Clinical trial exclusion criterion:
A compromised lung on the contralateral side of the block (Pneumothorax, hemothorax or Pneumonectomy).

Annotated entities:
- Condition: "compromised lung"
- Qualifier: "contralateral side of the block"
- Condition: "Pneumothorax"
- Condition: "hemothorax"
- Condition: "Pneumonectomy"